Clinical trial inclusion criterion:
New York Heart Association class II-IV symptoms

Annotated entities:
- Measurement: "New York Heart Association"
- Value: "class II-IV"
- Condition: "symptoms"